Clinical trial inclusion criterion:
Must have good compliance with medications Patients with asthma and COPD.

Entity relations:
- AND("good compliance", "medications")
- OR("asthma", "COPD")